Clinical trial inclusion criterion:
Patient is currently enrolled in a Novartis-sponsored, Oncology Clinical Development & Medical Affairs study receiving nilotinib and has fulfilled all their requirements in the parent study

Annotated entities:
- Temporal: "currently"
- Qualifier: "Novartis-sponsored"
- Observation: "enrolled in a Oncology Clinical Development & Medical Affairs study"
- Drug: "nilotinib"
- Non-representable: "has fulfilled all their requirements in the parent study"